目前大多數臨床 T3 期攝護腺癌之病人所採用治療方式為：
A. 攝護腺根除術
B. 攝護腺根除術加上放射線治療
C. 輔助性荷爾蒙治療加上放射線治療
D. 荷爾蒙治療

正確答案：C. 輔助性荷爾蒙治療加上放射線治療